Clinical trial inclusion criterion:
histologically confirmed metastatic cancer that is not amenable to surgery or radiation therapy with curative intent

Annotated entities:
- Condition: "metastatic cancer"
- Measurement: "histologically"
- Value: "confirmed"
- Procedure: "radiation therapy"
- Procedure: "surgery"
- Qualifier: "not amenable"